El síndrome de DiGeorge está ligado a:
1. Un desarrollo defectuoso del timo.
2. Una alteración del tejido linfoide secundario.
3. Una alteración de las células M.
4. Un defecto de maduración de los linfocitos B.
5. Una alteración en los sistemas reguladores del complemento.

Respuesta correcta: 1. Un desarrollo defectuoso del timo.